80歲女性因肺癌住院接受化學治療。住院第20天病人喘、寒顫、休克（血壓80/60 mmHg），X光顯示右下肺炎（lobar pneumonia），應進行的處置何者最不恰當？
A. 痰液鏡檢及培養
B. 血液培養兩
C. 白血球計數及分類
D. 給與第一代cephalosporin治療

正確答案：D. 給與第一代cephalosporin治療